與利用質體（plasmid）作為選殖基因載體相比，下列何者是利用yeast artificial chromosome（YAC）作為載體的優點？
A. 在宿主細胞中，重組DNA分子放大效果最佳
B. 送入任何宿主細胞之效率佳
C. 使基因在宿主細胞中蛋白質合成效率更好
D. 有選殖更大DNA片段之功能

正確答案：D. 有選殖更大DNA片段之功能